Clinical trial exclusion criterion:
severe liver dysfunction (Child-Pugh Score C)

Annotated entities:
- Qualifier: "severe"
- Condition: "liver dysfunction"
- Measurement: "Child-Pugh Score"
- Value: "C"